aged 30 to 85 years;

The above is a clinical trial inclusion criterion. Annotated with entity spans:
[Person: aged] [Value: 30 to 85 years];